Clinical trial exclusion criterion:
Allergic to penicillin

Entity relations:
- AND("Allergic", "penicillin")